病毒性出血熱可能隨	國際旅遊而傳播，下列何者死亡率最高？
A. Hantavirus
B. Ebola virus
C. Dengue virus
D. Yellow fever

正確答案：B. Ebola virus